挪瓦克（Norwalk）病毒感染造成腹瀉、嘔吐等症狀，此病毒之基因體為：
A. 雙股 RNA
B. 雙股 DNA
C. 正（＋）股 RNA
D. 負（－）股 RNA

正確答案：C. 正（＋）股 RNA